Phlorotannin is extracted from what plant?

Phlorotannin is extracted from Brown Seaweed or brown Algae